Clinical trial exclusion criterion:
Subjects were not to use any over-the-counter medication within 7 days prior to or during the study.

Entity relations:
- Has_temporal("over-the-counter medication", "within 7 days prior to the study")
- Has_negation("over-the-counter medication", "not")
- Has_index("during the study", "the study")
- OR("within 7 days prior to the study", "during the study")